Clinical trial exclusion criterion:
Identified as a natural or adopted child of the Investigator or employee with direct involvement in the proposed study

Annotated entities:
- Non-query-able: "Identified as a natural or adopted child of the Investigator or employee with direct involvement in the proposed study"